Clinical trial exclusion criterion:
Pregnancy (present, suspected, or planned)

Annotated entities:
- Condition: "Pregnancy"
- Temporal: "present"
- Mood: "suspected"
- Mood: "planned"